下列為脊椎內硬脊膜外腫瘤（intra-spinal, extra-dural tumor）之臨床症狀檢查發現，何者比較少見？
A. 神經痛
B. 運動乏力（motor weakness）
C. 反射減弱（hypo-reflexia）
D. 痙攣（spasticity）

正確答案：C. 反射減弱（hypo-reflexia）